Clinical trial exclusion criterion:
Person who is not available to follow the entire study protocol.

Annotated entities:
- Post-eligibility: "Person who is not available to follow the entire study protocol"